Clinical trial inclusion criterion:
Pathologically diagnosed with advanced gastric cancer (including adenocarcinoma of the gastroesophageal junction) with measurable metastases outside the stomach (measuring = 10mm on spiral CT scan, satisfying the criteria in RECIST 1.1);

Annotated entities:
- Condition: "advanced gastric cancer"
- Condition: "adenocarcinoma"
- Qualifier: "gastroesophageal junction"
- Condition: "metastases"
- Negation: "outside"
- Qualifier: "stomach"